Clinical trial exclusion criterion:
HIV positive

Annotated entities:
- Measurement: "HIV"
- Value: "positive"